Clinical trial inclusion criterion:
Willing to test for HIV

Annotated entities:
- Mood: "Willing to"
- Condition: "test for HIV"